Clinical trial exclusion criterion:
Guillain- Barré syndrome within eight weeks of a previous influenza vaccine

Entity relations:
- Has_temporal("influenza vaccine", "previous")
- multi("a previous influenza vaccine", "influenza vaccine")
- Has_index("within eight weeks of a previous influenza vaccine", "a previous influenza vaccine")
- Has_temporal("Guillain- Barré syndrome", "within eight weeks of a previous influenza vaccine")